何時是胚胎在子宮內膜著床的時間？
A. 排卵後第 7～10 天
B. 月經週期的第 16～18 天
C. 排卵後第 3～5 天
D. 月經週期的第 28～30 天

正確答案：A. 排卵後第 7～10 天